Clinically significant pericardial effusion (eg, moderate or larger or with hemodynamic compromise)

The above is a clinical trial exclusion criterion. Annotated with entity spans:
[Qualifier: Clinically significant] [Condition: pericardial effusion] (eg, [Qualifier: moderate or larger] or with [Condition: hemodynamic compromise])